Ante un recién nacido con una cardiopatía congénita sin plétora pulmonar pensaría en:
1. Comunicación interventricular.
2. Tronco arterioso persistente.
3. Atresia tricuspídea.
4. Ductus arterioso.

Respuesta correcta: 3. Atresia tricuspídea.